Clinical trial exclusion criterion:
Previous propofol infusion rate >4 mg/kg/h

Annotated entities:
- Temporal: "Previous"
- Measurement: "propofol infusion rate"
- Value: ">4 mg/kg/h"